Clinical trial inclusion criterion:
Use of a non-hormonal form of contraception, such as: sterilization (tubal ligation, Essure), copper IUD (intrauterine device), barrier methods or abstinence

Annotated entities:
- Procedure: "non-hormonal form of contraception"
- Procedure: "sterilization"
- Procedure: "tubal ligation"
- Procedure: "Essure"
- Procedure: "copper IUD"
- Procedure: "intrauterine device"
- Procedure: "barrier methods"
- Observation: "abstinence"